Clinical trial exclusion criterion:
Non-compliance with DOTPlus. Alternatively DOT can be done by telephoning patient on a daily basis 5 times a week and having patient annotate taking drug in a log which would be reviewed by clinic staff

Annotated entities:
- Condition: "Non-compliance"
- Procedure: "DOTPlus"
- Non-query-able: "Alternatively DOT can be done by telephoning patient on a daily basis 5 times a week and having patient annotate taking drug in a log which would be reviewed by clinic staff"